¿En qué estadio está la persona cuando comienzan a equilibrarse las consecuencias positivas y negativas del consumo de drogas y, como consecuencia de ello, empiezan a plantearse dejar de consumir, aunque básicamente mantienen su ambivalencia en este balance decisional?
1. Estadio de acción.
2. Estadio de contemplación.
3. Estadio de recaída.
4. Estadio de pre-contemplación.
5. Estadio de post-recaída.

Respuesta correcta: 2. Estadio de contemplación.